Provision of informed consent

The above is a clinical trial inclusion criterion. Annotated with entity spans:
[Informed_consent: Provision of informed consent]